下列那一種症狀或徵兆（symptom and/or sign），較遲才出現在晚期的慢性隅角開放型青光眼？
A. 眼壓增高
B. 視力模糊
C. 視野（visual field）缺損
D. 視神經盤凹陷（cup/disc ratio）變大

正確答案：B. 視力模糊